Clinical trial exclusion criterion:
age > 80 years;

Annotated entities:
- Person: "age"
- Value: "> 80 years"